Clinical trial exclusion criterion:
Need for chronic PN before study start

Entity relations:
- Has_index("before study start", "study start")
- Has_temporal("chronic PN", "before study start")